Positive HBeAg before starting NA treatment

The above is a clinical trial inclusion criterion. Annotated with entity spans:
[Value: Positive] [Measurement: HBeAg] [Temporal: before starting NA treatment]